Clinical trial exclusion criterion:
contraindication for collagenase clostridium histolyticym (Xiapex/Xiaflex ®)

Annotated entities:
- Condition: "contraindication"
- Drug: "collagenase clostridium histolyticym"
- Drug: "Xiapex"
- Drug: "Xiaflex"